Patients having received any other investigational product within recent 12 weeks

The above is a clinical trial exclusion criterion. Annotated with entity spans:
Patients having received any [Drug: other investigational product] [Temporal: within recent 12 weeks]